Neurological brain disease and/or history of electroconvulsive therapy;

The above is a clinical trial exclusion criterion. Annotated with entity spans:
[Qualifier: Neurological] [Condition: brain disease] and/or history of [Procedure: electroconvulsive therapy];